Clinical trial inclusion criterion:
All patients subjected to deep sedation in ambulant care, having a colonoscopy

Entity relations:
- AND("deep sedation", "ambulant")